Clinical trial exclusion criterion:
Significant hepatic or renal impairment (and/or alanine transaminase(ALT) or Aspartate transaminase(AST) >2 times upper limit of normal, creatinine clearance rate(CCr)<50%);

Annotated entities:
- Condition: "renal impairment"
- Condition: "hepatic impairment"
- Qualifier: "Significant"
- Measurement: "alanine transaminase(ALT)"
- Measurement: "Aspartate transaminase(AST)"
- Value: ">2 times upper limit of normal"
- Measurement: "creatinine clearance rate(CCr)"
- Value: "<50%"